La complicación más frecuente de las fracturas del cuello del astrágalo es:
1. Algodistrofia refleja.
2. Consolidación viciosa.
3. Pseudoartrosis.
4. Osteonecrosis.
5. Lesión neurológica del tibial posterior.

Respuesta correcta: 4. Osteonecrosis.